在尼古丁的戒癮治療中，下列那種治療方式成效最好？
A. 病人自己靠意志力戒除
B. 醫生建議病人戒除
C. 使用尼古丁貼片或口香糖
D. 使用戒菸藥物併用	體治療

正確答案：D. 使用戒菸藥物併用	體治療